Clinical trial exclusion criterion:
Patients with medical conditions that require chronic systemic corticosteroid therapy or require any other form of immunosuppressive medication. However, patients using physiologic replacement doses of hydrocortisone, or its equivalent, will be considered eligible for this study: up to 20 mg hydrocortisone (or 5 mg of prednisone) in the morning and 10 mg hydrocortisone (or 2.5 mg prednisone) in the evening.

Annotated entities:
- Condition: "medical conditions"
- Procedure: "systemic corticosteroid therapy"
- Temporal: "chronic"
- Drug: "immunosuppressive medication"
- Undefined_semantics: "immunosuppressive medication"
- Qualifier: "require chronic systemic corticosteroid therapy"
- Qualifier: "require immunosuppressive medication"
- Multiplier: "physiologic replacement doses"
- Drug: "hydrocortisone"
- Drug: "hydrocortisone"
- Multiplier: "up to 20 mg"
- Drug: "prednisone"
- Multiplier: "5 mg"
- Drug: "hydrocortisone"
- Multiplier: "10 mg"
- Drug: "prednisone"
- Multiplier: "2.5 mg"
- Multiplier: "in the morning"
- Multiplier: "in the evening"